Para observar las cápsulas bacterianas en un microscopio de campo claro se realiza una tinción:
1. Ácido resistente.
2. De Leifson.
3. Simple.
4. Negativa.
5. Diferencial.

Respuesta correcta: 4. Negativa.